What is Congo red agar plates used for?

Congo red agar plates are used as a canonical indicator of biofilm-formation ability. Culture on Congo red agar plates in which slime-producing strains form black colonies, while nonslime-forming ones develop red colonies.